下列那一類藥物可以使血管擴張（vasodilation）？
A. endothelin antagonists
B. kinin antagonists
C. neurotensin antagonists
D. vasopressin agonists

正確答案：A. endothelin antagonists